Clinical trial inclusion criterion:
Patient able to complete the questionnaire

Annotated entities:
- Observation: "able to complete the questionnaire"